Clinical trial inclusion criterion:
no medical history of cardiovascular and respiratory disease

Entity relations:
- Has_temporal("cardiovascular disease", "medical history")
- Has_negation("cardiovascular disease", "no")
- OR("cardiovascular disease", "respiratory disease")